Clinical trial exclusion criterion:
An initial plasma sodium concentration of higher than 150 mmol/L

Entity relations:
- Has_value("plasma sodium concentration", "higher than 150 mmol/L")
- Has_multiplier("plasma sodium concentration", "initial")